Clinical trial exclusion criterion:
Estimated glomerular filtration rate (eGFR) <30%.

Annotated entities:
- Measurement: "Estimated glomerular filtration rate (eGFR)"
- Value: "<30%"